Clinical trial inclusion criterion:
Zubrod performance status of 0-3

Annotated entities:
- Measurement: "Zubrod performance status"
- Value: "0-3"